下列疾病與其病理特徵的組合，何者正確？
A. 疱疹（ herpes） 病毒感染與空洞細胞（koilocyte）
B. 水泡狀胎塊（hydatidiform mole）與Call-Exner bodies
C. 卵黃囊瘤（yolk sac tumor）與Birbeck granules
D. 萊氏細胞瘤（Leydig cell tumor）與Reinke crystalloids

正確答案：D. 萊氏細胞瘤（Leydig cell tumor）與Reinke crystalloids